Clinical trial inclusion criteria:
Age >18 years old
1cm squared surface area
Venous incompetence confirmed by clinical assessment and duplex ultrasound scan
No evidence of arterial disease (Arterial Duplex or Ankle Brachial Pressure Index >0.9)
Patients able to complete trial procedures
Patients with a life expectancy of greater than 1 year

Annotated entities:
- Person: "Age"
- Value: ">18 years old"
- Measurement: "surface area"
- Value: "1cm squared"
- Condition: "Venous incompetence"
- Procedure: "clinical assessment"
- Procedure: "duplex ultrasound scan"
- Condition: "arterial disease"
- Negation: "No"
- Procedure: "Arterial Duplex"
- Measurement: "Ankle Brachial Pressure Index"
- Value: ">0.9"
- Post-eligibility: "Patients able to complete trial procedures"
- Observation: "life expectancy"
- Value: "greater than 1 year"